Clinical trial inclusion criterion:
1cm squared surface area

Entity relations:
- Has_value("surface area", "1cm squared")